下列有關女性生殖系統的敘述，何者錯誤？
A. 大前庭腺（greater vestibular gland）相當於男性的尿道球腺（bulbourethral gland）
B. 陰阜（mons pubis）之皮膚具有豐富的梅氏小體（Meissner's corpuscle）
C. 小陰唇的皮膚不具有毛髮
D. 小前庭腺（lesser vestibular gland）是屬於漿液性腺體（serous gland）

正確答案：D. 小前庭腺（lesser vestibular gland）是屬於漿液性腺體（serous gland）